Clinical trial inclusion criterion:
The ability to produce a visible precision grip force with one hand

Entity relations:
- Has_mood("produce a visible precision grip force with one hand", "The ability to")